Clinical trial exclusion criterion:
COPD exacerbation, very severe COPD with hypoxemia at low altitude (FEV1/FVC <0.7, FEV1 <40% predicted, oxygen saturation on room air <92% at 750 m).

Annotated entities:
- Condition: "COPD exacerbation"
- Qualifier: "very severe"
- Condition: "COPD"
- Condition: "hypoxemia"
- Qualifier: "low altitude"
- Measurement: "FEV1/FVC"
- Value: "<0.7"
- Measurement: "FEV1"
- Value: "<40% predicted"
- Measurement: "oxygen saturation"
- Qualifier: "room air"
- Value: "<92%"
- Qualifier: "750 m"